在周邊神經系統，神經髓鞘是由那種細胞所構成？
A. 星狀細胞
B. 衛星細胞
C. 許旺細胞
D. 寡樹突細胞

正確答案：C. 許旺細胞